Liver function: transaminase=2.5× upper limit of normal value,bilirubin=1.5×upper limit of normal value;

The above is a clinical trial inclusion criterion. Annotated with entity spans:
Liver function: [Measurement: transaminase][Value: =2.5× upper limit of normal value],[Measurement: bilirubin][Value: =1.5×upper limit of normal value];